Clinical trial inclusion criterion:
7. Pulse oximetry of > 90% on room air

Entity relations:
- Has_value("Pulse oximetry on room air", "> 90%")